結締組織中，下列何者製造並分泌基質（ground substance）？
A. 漿細胞（plasma cell）
B. 肥大細胞（mast cell）
C. 組織球（histiocyte）
D. 纖維母細胞（fibroblast）

正確答案：D. 纖維母細胞（fibroblast）